2 target lesions in the same coronary territory

The above is a clinical trial exclusion criterion. Annotated with entity spans:
[Multiplier: 2] [Condition: target lesions] [Qualifier: in the same coronary territory]